What is the role of ZNF335 in microcephaly?

Microcephaly gene links trithorax and REST/NRSF to control neural stem cell proliferation and differentiation. RNA-interference and postmortem human studies show that ZNF335 is essential for neural progenitor self-renewal, neurogenesis, and neuronal differentiation. Znf335 null mice are embryonically lethal, and conditional knockout leads to severely reduced cortical size.